有一位 40 歲女性，發現僅左側鎖骨上窩有一個 4 公分之硬塊，下列那一項是最不可能的原發病灶？
A. 肺癌
B. 喉癌
C. 胃癌
D. 子宮頸癌

正確答案：B. 喉癌